下列何者不是 low-renin 高血壓的特色？
A. 多見於非白種人
B. 對鹽分反應強
C. 多見體液增加
D. 預後（prognosis）不佳

正確答案：D. 預後（prognosis）不佳